Clinical trial exclusion criterion:
Pre-existing uncontrolled diarrhea

Annotated entities:
- Condition: "uncontrolled diarrhea"